Clinical trial inclusion criteria:
Men or women, 18 to 65 years old with a BMI of 35 kg/m2 or greater who will be undergoing bariatric surgery (VSG and RYGB)
Signed written informed consent
Women of childbearing potential (WOCBP) must have a negative serum or urine pregnancy test (minimum sensitivity 25 IU/L or equivalent units of HCG) within 24 hours prior to the start of study drug
Women must not be breastfeeding

Annotated entities:
- Person: "Men"
- Person: "women"
- Person: "old"
- Value: "18 to 65 years"
- Measurement: "BMI"
- Value: "35 kg/m2 or greater"
- Procedure: "bariatric surgery"
- Procedure: "VSG"
- Procedure: "RYGB"
- Informed_consent: "Signed written informed consent"
- Pregnancy_considerations: "Women of childbearing potential (WOCBP) must have a negative serum or urine pregnancy test (minimum sensitivity 25 IU/L or equivalent units of HCG) within 24 hours prior to the start of study drug"
- Pregnancy_considerations: "Women must not be breastfeeding"